Clinical trial inclusion criteria:
Subjects referred to diagnostic or therapeutic colonoscopy.

Annotated entities:
- Observation: "diagnostic"
- Observation: "therapeutic"
- Procedure: "colonoscopy"